Clinical trial exclusion criterion:
Anaemia not attributed to iron deficiency, e.g. other microcytic anaemia

Entity relations:
- Has_mood("iron deficiency", "attributed to")
- Has_qualifier("microcytic anaemia", "other")
- Has_negation("iron deficiency", "not")
- AND("Anaemia", "iron deficiency")
- Subsumes("Anaemia", "microcytic anaemia")